What particles is Hadron therapy using?

Hadron therapy is using proton beams.